Patients are not expected to be alive for longer than 3 months.

The above is a clinical trial exclusion criterion. Annotated with entity spans:
Patients are [Negation: not] [Observation: expected to be alive] for [Value: longer than 3 months].